Clinical trial inclusion criterion:
Patients with biopsy-proven metastatic carcinoid tumors or other neuroendocrine tumors (Islet cell, Gastrinomas and VIPomas) with at least one measurable lesion (other than bone) that has either not been previously irradiated or if previously irradiated has demonstrated progression since the radiation therapy

Entity relations:
- Has_value("biopsy", "proven")
- AND("metastatic carcinoid tumors", "biopsy")
- Subsumes("other neuroendocrine tumors", "Islet cell")
- Has_temporal("progression", "since the radiation therapy")
- Has_negation("irradiated", "not been")
- Has_context("irradiated", "progression")
- AND("metastatic carcinoid tumors", "measurable lesion")
- AND("measurable lesion", "irradiated")
- multi("radiation therapy", "radiation therapy")
- Has_index("since the radiation therapy", "radiation therapy")
- Has_negation("bone", "other than")
- Has_qualifier("measurable lesion", "bone")
- OR("Islet cell", "Gastrinomas", "VIPomas")
- OR("metastatic carcinoid tumors", "other neuroendocrine tumors")
- OR("irradiated", "irradiated")